Clinical trial inclusion criterion:
Knee symptomatic OA (Kellgren-Lawrence grade 1-4)

Entity relations:
- Has_qualifier("OA Knee", "symptomatic")
- Has_value("Kellgren-Lawrence grade", "1-4")
- Subsumes("symptomatic", "Kellgren-Lawrence grade")